Other invasive malignancies within 5 years prior to Day 1

The above is a clinical trial exclusion criterion. Annotated with entity spans:
[Qualifier: Other] [Condition: invasive malignancies] [Temporal: within 5 years prior to Day 1]